Clinical trial exclusion criterion:
use illicit drugs or relapse during the last trimester of pregnancy

Entity relations:
- Has_index("during the last trimester of pregnancy", "the last trimester of pregnancy")
- Has_qualifier("pregnancy", "last trimester")
- multi("the last trimester of pregnancy", "pregnancy")
- Has_temporal("illicit drugs", "during the last trimester of pregnancy")
- OR("illicit drugs", "relapse")